Clinical trial inclusion criterion:
=2 risk factors: diabetes mellitus, age =70 years, BMI =30, fascial enlargement

Entity relations:
- Has_multiplier("risk factors", "=2")
- Has_value("age", "=70 years")
- Has_value("BMI", "=30")
- Subsumes("risk factors", "diabetes mellitus")
- OR("diabetes mellitus", "BMI", "fascial enlargement", "age")